Documented genotype 1 HCV infection prior to enrollment and after their transplant in the post-transplantation cohort

The above is a clinical trial inclusion criterion. Annotated with entity spans:
Documented [Qualifier: genotype 1] [Condition: HCV infection] [Temporal: prior to enrollment] and [Temporal: after their transplant i]n the post-transplantation cohort